Clinical trial exclusion criterion:
combined surgical procedures

Annotated entities:
- Procedure: "combined surgical procedures"